Clinical trial exclusion criterion:
Associated disease which could prevent patient from receiving treatment

Annotated entities:
- Condition: "Associated disease"
- Qualifier: "could prevent patient from receiving treatment"
- Undefined_semantics: "Associated disease which could prevent patient from receiving treatment"